下列關於流行性感冒（influenza）的敘述，何者錯誤？
A. 其症狀常常突然發生，包括頭痛、倦怠、發燒、咳嗽、肌肉酸痛等
B. 老年人罹患流行性感冒之後可能引起肺炎而導致死亡
C. 抗病毒藥物 oseltamivir（Tamiflu）目前僅對 A 型流行性感冒有效而對 B 型流行性感冒無效，一般使用期為 5 天
D. 預防策略方面可建議高危險群施打流行性感冒疫苗

正確答案：C. 抗病毒藥物 oseltamivir（Tamiflu）目前僅對 A 型流行性感冒有效而對 B 型流行性感冒無效，一般使用期為 5 天